Clinical trial exclusion criterion:
Presence of severe systemic disease

Entity relations:
- Has_qualifier("systemic disease", "severe")